Clinical trial inclusion criterion:
ASA (American Society of Anesthesiologist) status 1-3 (27)

Entity relations:
- Subsumes("ASA status", "American Society of Anesthesiologist status")
- Subsumes("1-3", "27")
- Has_value("ASA status", "1-3")